Body Mass Index >29.9

The above is a clinical trial exclusion criterion. Annotated with entity spans:
[Measurement: Body Mass Index] [Value: >29.9]